一位 35 歲男性因為右手麻木感來就醫，診斷為腕道症候群（carpal tunnel syndrome）同時體檢發現其下巴突出及高血壓。隨機抽血測得生長激素（growth hormone）值為 10 ng/mL（normal range 0～ ng/mL）。應該先做何處置？
A. 葡萄糖抑制試驗（glucose suppression test）
B. 腦下垂體核磁共振影像檢查（pituitary MRI examination）
C. 腦下垂體功能檢查（pituitary function tests including TSH，FSH，ACTH）
D. 胰島素低血糖試驗（insulin hypoglycemic test）

正確答案：A. 葡萄糖抑制試驗（glucose suppression test）